¿Cuál de entre los siguientes nombres se corresponde con el de una serie del espectro de emisión del átomo de hidrógeno?:
1. Lewis.
2. Balmer.
3. Carter.
4. Thomson.

Respuesta correcta: 2. Balmer.